下列有關淚液排泄系統（tear excretory system）之敘述，何者錯誤？
A. 淚液在眼睛表面的分布主要靠眼瞼的眨眼動作（blinking）
B. 眼瞼閉合不良的病患，常伴隨淚溢（epiphora）症狀
C. 鼻淚管的開口位於中鼻甲（middle nasal meatus）
D. 先天性鼻淚管阻塞最常見的原因是Hasner氏瓣膜未開通

正確答案：C. 鼻淚管的開口位於中鼻甲（middle nasal meatus）